Clinical trial exclusion criterion:
Patients who received immunosuppressive medication in the last 6 weeks (e.g. cyclosporin, cyclophosphamide, azathioprine).

Entity relations:
- Has_temporal("immunosuppressive medication", "in the last 6 weeks")
- AND("immunosuppressive medication", "cyclosporin")
- OR("cyclosporin", "cyclophosphamide", "azathioprine")